若血液黏滯係數（blood viscosity）增加時，最可能直接引起下列那一改變？
A. 周邊總阻力（total peripheral resistance）增加
B. 小動脈（arterioles）半徑增加
C. 平均動脈壓（mean arterial pressure）下降
D. 心搏量（stroke volume）增加

正確答案：A. 周邊總阻力（total peripheral resistance）增加